在骨骼肌內，鈣離子藉由與何者結合而產生收縮？
A. 旋轉肌凝蛋白（tropomyosin）
B. 肌動蛋白（actin）
C. 旋轉子（troponin）
D. 肌凝蛋白（myosin）

正確答案：C. 旋轉子（troponin）